Clinical trial exclusion criteria:
Patients under the age of 18 (Subjects under the age of 18 will not be included in this study due to the continued growth and development of their joints and unstudied effects on children.)
Over the age of 80
Multiple pain sources and multifactorial pain sources that complicated or confound diagnosing the SI joint as the primary and predominant pain generator that may contribute to low back pain (including but not limited to: lumbar diagnosis, lumbar radiculopathy, intra or extra-articular hip pathology to include acetabulum and femoral head, lumbo-sacral joint pathology, intervertebral disk disease, spondylolisthesis/spondylosis/spondylolysis of lumbar vertebra)
Immunosuppressed/immune compromised
Underlying comorbidities that contraindicate the procedure (including but not limited to polycythemia, coagulation disorder, or malignancy).

Annotated entities:
- Person: "age"
- Value: "18 under"
- Non-representable: "(Subjects under the age of 18 will not be included in this study due to the continued growth and development of their joints and unstudied effects on children.)"
- Value: "Over 80"
- Person: "age"
- Condition: "Multiple pain sources"
- Condition: "multifactorial pain sources"
- Non-representable: "that complicated or confound diagnosing the SI joint as the primary and predominant pain generator that may contribute to low back pain"
- Condition: "lumbar diagnosis"
- Condition: "lumbar radiculopathy"
- Condition: "extra-articular hip pathology"
- Condition: "intra -articular hip pathology"
- Condition: "acetabulum pathology"
- Condition: "femoral head pathology"
- Condition: "lumbo-sacral joint pathology"
- Condition: "intervertebral disk disease"
- Condition: "spondylolisthesis"
- Condition: "spondylosis"
- Condition: "spondylolysis of lumbar vertebra"
- Condition: "Immunosuppressed"
- Condition: "immune compromised"
- Condition: "Underlying comorbidities"
- Qualifier: "contraindicate the procedure"
- Condition: "contraindicate"
- Procedure: "procedure"
- Condition: "polycythemia"
- Condition: "coagulation disorder"
- Condition: "malignancy"